Subjects were to have no history of known hypersensitivity or idiosyncratic reaction to the study drug or related compounds.

The above is a clinical trial exclusion criterion. Annotated with entity spans:
Subjects were to have [Negation: no] history of known [Condition: hypersensitivity] or [Condition: idiosyncratic reaction] to the [Drug: study drug] or related compounds.